Which molecule is targeted by a monoclonal antibody Secukinumab?

Secukinumab (AIN457) is a fully human anti-interleukin-17A monoclonal antibody that neutralizes interleukin-17A.